Clinical trial inclusion criterion:
eGFR>60 ml/min healthy volunteers type 2 diabetes patients who otherwise healthy

Entity relations:
- Has_value("eGFR", ">60 ml/min")